Clinical trial exclusion criterion:
child took any antihistamine in the past three days [including diphenhydramine (Benadryl®), cetirizine (Zyrtec®), loratadine (Claritin®), fexofenadine (Allegra®), levocetirizine (Xyzal®), and desloratadine (Clarinex®)] or

Annotated entities:
- Drug: "antihistamine"
- Temporal: "in the past three days"
- Drug: "diphenhydramine"
- Drug: "Benadryl"
- Drug: "cetirizine"
- Drug: "Zyrtec"
- Drug: "loratadine"
- Drug: "Claritin"
- Drug: "fexofenadine"
- Drug: "Allegra"
- Drug: "levocetirizine"
- Drug: "Xyzal"
- Drug: "desloratadine"
- Drug: "Clarinex"